Clinical trial inclusion criterion:
Subjects of STEMI who underwent primary PCI within the first 12 hours.

Entity relations:
- AND("STEMI", "primary PCI")
- Has_temporal("primary PCI", "within the first 12 hours.")